下列何種抗癌藥物其主要作用位置在於細胞週期的 M phase？
A. Paclitaxel
B. Etoposide
C. Methotrexate
D. Cisplatin

正確答案：A. Paclitaxel